Clinical trial inclusion criterion:
3 -15 years old

Entity relations:
- Has_value("old", "3 -15 years")